下列有關 papillary renal cell carcinoma 的敘述，何者錯誤？
A. 來自遠端集尿管的上皮細胞，有兩側性及多發性
B. 腫瘤長大時會有出血及囊狀變化
C. 部分病例與 MET protooncogene 的 mutational activation 有關係
D. 與 hepatocyte growth factor 有關係

正確答案：A. 來自遠端集尿管的上皮細胞，有兩側性及多發性